氣喘病是一種慢性發炎反應，也是氣道的過度敏感反應。下列對於氣喘病造成氣道管徑縮小的敘述，何者錯誤？
A. 包住小支氣管的平滑肌收縮，而使氣道收縮
B. 嗜伊紅性細胞（eosinophil）及嗜中性多核白血球（neutrophil）等發炎細胞聚集、浸潤於氣道
C. 表皮細胞增生，增加管壁厚度而阻塞氣道
D. 黏液分泌增加及呼吸道組織水腫而阻塞氣道

正確答案：C. 表皮細胞增生，增加管壁厚度而阻塞氣道